Clinical trial exclusion criterion:
People with missing hand(s) and/or leg(s)

Entity relations:
- OR("missing hand", "missing leg")